急性發炎反應時，組織胺（Histamine）會造成血管通透性的增加。下列何種細胞最可能釋放組織胺？
A. 淋巴球（Lymphocyte）
B. 巨噬細胞（Macrophage）
C. 肥大細胞（Mast cell）
D. 嗜中性白血球（Neutrophil）

正確答案：C. 肥大細胞（Mast cell）